氣喘病是一種慢性發炎反應，也是氣管的過度敏感反應。下列對於氣喘病造成氣管的管徑縮小的描述，何者錯誤？
A. 包住小支氣管的平滑肌收縮，而使氣管收縮
B. 嗜伊紅性細胞（eosinophil），嗜中性白血球（neutrophil）等發炎細胞聚集充塞氣管
C. 表皮細胞增生，增加管壁厚度而阻塞氣管
D. 黏液分泌增加及呼吸道組織水腫而阻塞氣管

正確答案：C. 表皮細胞增生，增加管壁厚度而阻塞氣管